Clinical trial exclusion criterion:
Patients having received any other investigational product within recent 12 weeks

Annotated entities:
- Drug: "other investigational product"
- Temporal: "within recent 12 weeks"